Has a chronic illness (e.g., liver or kidney disease), receiving a concomitant therapy or have any other condition that could interfere with the subject's participation in the study or in the interpretation of the study results

The above is a clinical trial exclusion criterion. Annotated with entity spans:
Has a [Condition: chronic illness] (e.g., [Condition: liver] or [Condition: kidney disease]), receiving a [Temporal: concomitant] [Procedure: therapy] or have [Condition: any other condition] that [Qualifier: could interfere with the subject's participation in the study] or in the interpretation of the study results